Clinical trial exclusion criterion:
Known hypersensitivity to any of the study drugs, including the excipients, or any drugs formulated in polysorbate 80.

Annotated entities:
- Condition: "hypersensitivity"
- Drug: "study drugs"
- Drug: "drugs formulated in polysorbate 80"